Which gene is responsible for the Liebenberg syndrome?

We discuss the genetic abnormality that causes Liebenberg syndrome, the genomic rearrangement at the PITX1 locus on chromosome 5